Clinical trial inclusion criterion:
Primary psychiatric diagnosis of Major Depressive Disorder, without psychotic features, confirmed via SCID-IV structured diagnostic interview.

Annotated entities:
- Qualifier: "Primary"
- Condition: "Major Depressive Disorder"
- Negation: "without"
- Condition: "psychotic features"